下列何種疾病不會出現連續性雜音（continuous murmur）？
A. patent ductus arteriosus
B. coronary AV fistula
C. atrial septal defect
D. ruptured sinus of Valsalva aneurysm

正確答案：C. atrial septal defect